急性泌尿道感染（urinary tract infection），若沒有放導尿管，無泌尿道結構異常，也沒有結石（calculi），則最常見的病原菌為那一種？
A. Proteus
B. E. coli
C. Klebsiella
D. Enterobacter

正確答案：B. E. coli